Clinical trial exclusion criterion:
Liver dysfunction and elevated Liver Function Tests (LFTs)

Annotated entities:
- Condition: "Liver dysfunction"
- Value: "elevated"
- Measurement: "Liver Function Tests"
- Measurement: "LFTs"